Dual organ or kidney after another solid organ transplant

The above is a clinical trial exclusion criterion. Annotated with entity spans:
[Condition: Dual organ] or kidney after another [Procedure: solid organ transplant]